Redo surgeries

The above is a clinical trial exclusion criterion. Annotated with entity spans:
[Procedure: Redo surgeries]